Clinical trial exclusion criterion:
14. History of obstructive sleep apnea.

Annotated entities:
- Parsing_Error: "14."
- Condition: "obstructive sleep apnea"
- Temporal: "History"